La secuenciación de un oligosacárido se hace mediante:
1. Degradación Edman.
2. Cromatografía Whatman.
3. Patch-Clamp.
4. Espectometría de masas.
5. Electroforesis capilar.

Respuesta correcta: 4. Espectometría de masas.